Clinical trial exclusion criterion:
Known serious hypersensitivity to other parenteral iron products

Annotated entities:
- Condition: "hypersensitivity"
- Drug: "parenteral iron products"
- Qualifier: "serious"